Willing and able to provide written informed consent and accept study procedures and time schedule.

The above is a clinical trial inclusion criterion. Annotated with entity spans:
[Informed_consent: Willing and able to provide written informed consent and accept study procedures and time schedule.]